Clinical trial exclusion criterion:
Hemoglobin <1.05 g/dl at the time of initiation of therapy

Annotated entities:
- Measurement: "Hemoglobin"
- Value: "<1.05 g/dl"
- Temporal: "at the time of initiation of therapy"
- Reference_point: "initiation of therapy"